Subjects must be 18 years or older

The above is a clinical trial inclusion criterion. Annotated with entity spans:
Subjects must be [Value: 18 years or older]